下列何處是嬰兒最常進行腦池穿刺（cisternal puncture）以獲取腦脊髓液（CSF）的地方？
A. 大腦腳間池（interpeduncular cistern）
B. 小腦延髓後池（posterior cerebellomedullary cistern）
C. 四疊體池（quadrigeminal cistern）
D. 橋腦池（pontine cistern）

正確答案：B. 小腦延髓後池（posterior cerebellomedullary cistern）